小兒麻痺症病毒有兩個變種 A 及 B，若細胞單獨感染 A 變種或是 B 變種均不會產生病毒。但若同時 感染 A 及 B 變種，下列那一種情況最可能發生？
A. 基因會重組產生野生型病毒（wild type virus）
B. 病毒基因會反轉錄成 DNA，而產生 A 及 B 病毒
C. 兩種變種發生互補作用，而產生 A 及 B 病毒
D. 細胞會變成癌細胞

正確答案：C. 兩種變種發生互補作用，而產生 A 及 B 病毒